陳同學是 25 歲博士班研究生，因通過資格考試而與同學去聚餐慶祝，隔天早上起床發現手腳無力，但無感覺異常，也無吞嚥困難或口齒不清的狀況，且神智清楚，而被送至急診求助，有關陳同學之病情，下列敘述何者錯誤？
A. 可能出現低血鉀
B. 肌腱反射低下
C. 有複視現象
D. 有家族遺傳傾向

正確答案：C. 有複視現象